Clinical trial inclusion criterion:
Corneal ulcer that is smear positive for either bacteria or filamentous fungus

Entity relations:
- Has_qualifier("smear", "bacteria")
- Has_value("smear", "positive")
- AND("Corneal ulcer", "smear")
- OR("bacteria", "filamentous fungus")